Clinical trial inclusion criterion:
Estimated glomerular filtration rate =20 mL/min and <60 mL/min

Entity relations:
- Has_value("Estimated glomerular filtration rate", "=20 mL/min and <60 mL/min")